Absolute neutrophil count (ANC) greater than or equal to 1.5 x 10^9/L without growth factor use in the 2 weeks before study randomization

The above is a clinical trial inclusion criterion. Annotated with entity spans:
[Measurement: Absolute neutrophil count] ([Measurement: ANC]) [Value: greater than] or [Value: equal to 1.5 x 10^9/L] [Negation: without] [Observation: growth factor use] [Temporal: in the 2 weeks before study randomization]